Pain duration <2 weeks (336 hours). Patients with more than two weeks of pain are at increased risk of poor pain and functional outcomes.(9)

The above is a clinical trial inclusion criterion. Annotated with entity spans:
[Condition: Pain] [Temporal: duration <2 weeks] (336 hours). Patients with more than two weeks of pain are at increased risk of poor pain and functional outcomes.(9)